Clinical trial inclusion criterion:
Only patients with atrial fibrillation, above 18 years, and with TTR <50% based on the last three values of INR will be included in this study.

Entity relations:
- Has_value("years", "above 18 years")
- Has_value("TTR", "<50%")
- Has_qualifier("TTR", "based on the last three values of INR")